What is the inheritance pattern of Hunter disease or mucopolysaccharidosis II?

X- linked recessive